Hb A1c 7.0-10.0%

The above is a clinical trial inclusion criterion. Annotated with entity spans:
[Measurement: Hb A1c] [Value: 7.0-10.0%]